Clinical trial inclusion criterion:
Serum ALT within normal limits with no history of liver disease

Entity relations:
- Has_value("Serum ALT", "within normal limits")
- Has_negation("liver disease", "no")
- Has_temporal("liver disease", "history")